The patient is participating in another study

The above is a clinical trial exclusion criterion. Annotated with entity spans:
[Competing_trial: The patient is participating in another study]